Las condiciones de reacción para la preparación de 2-metil-1-metoxipropan-2-ol a partir de 2,2-dimetiloxirano son:
1. La reacción con metanol en medio ácido.
2. No hay una ruta sintética eficaz.
3. La reacción con bromuro de metilmagnesio e hidrólisis posterior.
4. La reacción con metóxido de sodio en metanol.
5. La reacción con trifenilfosfina.

Respuesta correcta: 4. La reacción con metóxido de sodio en metanol.